一位65歲的男性病人，三年前有陳舊性心肌梗塞、高血壓、糖尿病、血脂異常及吸菸之習 慣，在給予包括beta blocker及ACE inhibitor之降壓及控制血糖及血脂的藥物後，您建議病人每日服用100 mg之aspirin，但病人說他胃酸比較多可能有胃潰瘍，又聽說aspirin會傷胃，有人告訴他dipyridamole可以取代aspirin又可以保護心臟，堅持要使用dipyridamole。下列處置何者最不恰當？
A. 基於病患自主的原則，給予dipyridamole
B. 處方esomeprazole，搭配aspirin使用
C. 處方clopidogrel使用
D. 轉介病人給腸胃科醫師看是否須安排胃腸內視鏡檢查

正確答案：A. 基於病患自主的原則，給予dipyridamole